Clinical trial exclusion criterion:
an underlying infectious disease

Annotated entities:
- Condition: "infectious disease"
- Qualifier: "underlying"